一位 45 歲病患，在中風症狀發生後 1 小時之內被送到某醫學中心。經過頭部電腦斷層檢查、急診科與神經內科醫師的評估後，病患符合施打血栓溶解劑 r-tPA 的條件，家屬很焦急的詢問有關 r-tPA 的禁忌症。下列何者非急性梗塞性腦中風（acute stroke）病患使用 r-tPA 的絕對禁忌症？
A. 先前曾經有過腦出血
B. 有胃潰瘍病史
C. 1 個月前有缺血性腦中風
D. 3 週前動過顱內手術

正確答案：B. 有胃潰瘍病史